Syncope related to cardiac disease

The above is a clinical trial exclusion criterion. Annotated with entity spans:
[Condition: Syncope] related to [Condition: cardiac disease]